Male or female >40 and <70 years old.

The above is a clinical trial inclusion criterion. Annotated with entity spans:
[Person: Male] or [Person: female] [Value: >40 and <70 years] [Person: old].